Please list the syndromes that are part of Castleman's disease AKA TAFRO

The syndromes that are part of Castleman's disease AKA TAFRO are organomegaly, anasarca, myelofibrosis, thrombocytopenia, reticulin fibrosis and renal dysfunction.